Known or suspected clinically unstable systemic medical disorder

The above is a clinical trial inclusion criterion. Annotated with entity spans:
[Mood: Known] or [Mood: suspected] [Qualifier: clinically unstable] [Qualifier: systemic] [Condition: medical disorder]